Clinical trial exclusion criterion:
Allergic to contrast substance or radioisotope drugs used in procedures to assess endpoints of the study, which according to researchers, may be a contraindication to the implementation of these research methods.

Entity relations:
- AND("Allergic", "contrast substance")
- OR("contrast substance", "radioisotope drugs")